Preexistent chronic renal failure.

The above is a clinical trial exclusion criterion. Annotated with entity spans:
[Temporal: Preexistent] [Condition: chronic renal failure].